Clinical trial inclusion criterion:
previous treatment with diuretics

Entity relations:
- AND("treatment", "diuretics")
- Has_temporal("treatment", "previous")